Clinical trial exclusion criterion:
Late diabetic complications as retinopathy, renal insufficiency, neuropathy or previous pancreatitis.

Entity relations:
- Has_temporal("pancreatitis", "previous")
- Subsumes("Late diabetic complications", "retinopathy")
- OR("retinopathy", "pancreatitis", "renal insufficiency", "neuropathy")